Clinical trial exclusion criterion:
Estimated CrCl < 60 mL/min

Annotated entities:
- Measurement: "Estimated CrCl"
- Value: "< 60 mL/min"